not in menopause and not have hot flashes

The above is a clinical trial exclusion criterion. Annotated with entity spans:
[Negation: not] in [Condition: menopause] and [Negation: not] have [Condition: hot flashes]